Clinical trial exclusion criterion:
History of autoimmune hepatitis

Annotated entities:
- Condition: "autoimmune hepatitis"
- Temporal: "History"